Clinical trial exclusion criterion:
History of Crohn's Disease, Irritable Bowel Syndrome, radiation therapy in the rectoanal region

Annotated entities:
- Condition: "Crohn's Disease"
- Condition: "Irritable Bowel Syndrome"
- Procedure: "radiation therapy"
- Qualifier: "rectoanal region"
- Temporal: "History"